Inability to provide written informed consent obtained at time of study enrollment.

The above is a clinical trial exclusion criterion. Annotated with entity spans:
[Informed_consent: Inability to provide written informed consent obtained at time of study enrollment.]